王先生，45 歲，在腹部手術後出現呼吸急促。血壓、脈搏、心電圖檢查皆正常，肺部聽診及胸部 X 光檢查發現肺部有許多分泌物無法咳出。動脈血中氧分壓為 88 mmHg，二氧化碳分壓為 40 mmHg。 下列何種復健訓練對王先生最沒有幫助？
A. 放鬆及呼吸訓練（relaxation and breathing exercise）
B. 姿勢引流及拍痰（posture drainage）
C. 輔助性咳嗽訓練（assistive cough）
D. 舌咽呼吸（glossopharyngeal breathing）

正確答案：D. 舌咽呼吸（glossopharyngeal breathing）